Fasting glucose >140 mg/dl or random glucose >180 mg/dl

The above is a clinical trial inclusion criterion. Annotated with entity spans:
[Measurement: Fasting glucose] [Value: >140 mg/dl] or [Measurement: random glucose] [Value: >180 mg/dl]